History of other significant skin disease, or skin manifestations of allergic illness or other dermatologic condition, except chronic moderate or severe atopic dermatitis, that would interfere with the trial assessments or compromise the patient's safety according to the opinion of the Investigator

The above is a clinical trial exclusion criterion. Annotated with entity spans:
[Temporal: History] of other [Qualifier: significant] [Condition: skin disease], or [Condition: skin manifestations] of [Condition: allergic illness] or other [Condition: dermatologic condition], [Negation: except] [Qualifier: chronic moderate] or [Qualifier: severe] [Condition: atopic dermatitis], that [Subjective_judgement: would interfere with the trial assessments or compromise the patient's safety according to the opinion of the Investigator]